What is the effect of CPEB3 binding to the CPE domain?

The cytoplasmic polyadenylation element (CPE) is the binding platform for CPE-binding protein (CPEB), which promotes polyadenylation-induced translation.